Hepatitis B virus DNA <100 IU/mL.

The above is a clinical trial inclusion criterion. Annotated with entity spans:
[Measurement: Hepatitis B virus DNA] [Value: <100 IU/mL].